Which are the plant DNA (cytosine-5) methyltransferase families?

The plant DNA (cytosine-5)methyltransferases are classified into the families: MET, CMT, and the de novo DRM.